scheduled for elective CD under spinal anesthesia

The above is a clinical trial inclusion criterion. Annotated with entity spans:
[Mood: scheduled for] [Qualifier: elective] [Procedure: CD] under [Procedure: spinal anesthesia]